下列那種酶所催化之反應不產生二氧化碳？
A. 異檸檬酸脫氫酶（isocitrate dehydrogenase）
B. 3-磷酸甘油醛脫氫酶（glyceraldehyde-3-phosphate dehydrogenase）
C. α-酮戊二酸脫氫酶（α-ketoglutarate dehydrogenase）
D. 丙酮酸脫氫酶（pyruvate dehydrogenase）

正確答案：B. 3-磷酸甘油醛脫氫酶（glyceraldehyde-3-phosphate dehydrogenase）